Clinical trial inclusion criterion:
Post-bronchodilator spirometry will be performed approximately 15 minutes after the subject has self-administered 4 inhalations (i.e., total 400mcg) of albuterol/salbutamol via a metered dose inhaler (MDI )with a valved-holding chamber. The FEV1/FVC ratio and FEV1 percent predicted values will be calculated.

Entity relations:
- Has_index("Post-bronchodilator", "bronchodilator")
- Has_temporal("Post-bronchodilator", "Post-bronchodilator")
- Has_qualifier("spirometry", "Post-bronchodilator")
- Has_temporal("spirometry", "approximately 15 minutes after")
- Has_multiplier("inhalations", "4")
- Has_qualifier("inhalations", "self-administered")
- Subsumes("4", "400mcg")
- AND("inhalations", "albuterol")
- Has_qualifier("metered dose inhaler (MDI )", "with a valved-holding chamber")
- AND("inhalations", "metered dose inhaler (MDI )")
- AND("inhalations", "salbutamol")